Clinical trial inclusion criterion:
Subject's age is between =12 and 16 years, inclusive

Entity relations:
- Has_value("age", "between =12 and 16 years")